Congenital eye malformations in the study eye.

The above is a clinical trial exclusion criterion. Annotated with entity spans:
[Condition: Congenital eye malformations] [Qualifier: in the study eye].